Clinical trial inclusion criterion:
Patients of child-bearing potential should be using adequate contraceptive measures should not be breast feeding and must have a negative pregnancy test prior to start of dosing

Annotated entities:
- Observation: "child-bearing potential"
- Procedure: "adequate contraceptive measures"
- Negation: "not be"
- Condition: "breast feeding"
- Value: "negative"
- Measurement: "pregnancy test"
- Temporal: "prior to start of dosing"
- Reference_point: "start of dosing"